Clinical trial exclusion criteria:
Confirmed allergy to apatinin and or its excipients;
Hypertension (high blood pressure) that can not be controlled by drugs;
A history of active hemorragge, ulcer, intestinal perforation, intestinal obstruction, or major surgery no older than 30 days;
NYHA III-IV heart function, or severe hepatic or renal insufficiency (Grade 4);
Presence of multiple factors that affect oral medications, such as difficulty swallowing, nausea, vomiting, chronic diarrhea and intestinal obstruction;
Pregnant or lactating women, or women of child-bearing potential who have planned a pregnancy, or male and female patients who do not agree to practice adequate contraception during this study;
Patients who have a history of psychotropics abuse and can not quit, or who have mental disorders;
Participation in other drug clinical trial within the last 4 weeks;
Prior therapy with VEGFR inhibitors such as sorafenib and sunitinib;
Presence of comorbidities that seriously affect the patient's safety or ability to complete the study, in the investigator's judgment;
Patients who can not tolerate apatinib treatment as judged by the investigator depending on the their medical history;
Patients that are considered ineligible for this study by the investigator.

Annotated entities:
- Condition: "allergy"
- Drug: "apatinin"
- Drug: "excipients"
- Condition: "Hypertension"
- Condition: "high blood pressure"
- Qualifier: "controlled by drugs"
- Drug: "drugs"
- Negation: "not"
- Qualifier: "active"
- Condition: "hemorragge"
- Condition: "ulcer"
- Condition: "intestinal perforation"
- Condition: "intestinal obstruction"
- Condition: "major surgery"
- Temporal: "no older than 30 days"
- Measurement: "NYHA"
- Value: "III-IV"
- Condition: "heart function"
- Qualifier: "severe"
- Condition: "hepatic insufficiency"
- Condition: "renal insufficiency"
- Qualifier: "Grade 4"
- Observation: "factors that affect oral medications"
- Condition: "difficulty swallowing"
- Condition: "nausea"
- Condition: "vomiting"
- Condition: "chronic diarrhea"
- Condition: "intestinal obstruction"
- Pregnancy_considerations: "Pregnant or lactating women, or women of child-bearing potential who have planned a pregnancy, or male and female patients who do not agree to practice adequate contraception during this study;"
- Temporal: "history"
- Condition: "abuse"
- Drug: "psychotropics"
- Condition: "mental disorders"
- Non-representable: "and can not quit"
- Competing_trial: "Participation in other drug clinical trial within the last 4 weeks;"
- Drug: "VEGFR inhibitors"
- Drug: "sorafenib"
- Drug: "sunitinib"
- Non-query-able: "Presence of comorbidities that seriously affect the patient's safety or ability to complete the study, in the investigator's judgment;"
- Condition: "tolerate"
- Negation: "not"
- Drug: "apatinib"
- Non-query-able: "Patients that are considered ineligible for this study by the investigator."